malignant tumor;

The above is a clinical trial exclusion criterion. Annotated with entity spans:
[Condition: malignant tumor];